Clinical trial exclusion criterion:
patients with infected miscarriage/abortion (presence of fever, pus from the cervix, leukocytosis [> 14000]);

Annotated entities:
- Qualifier: "infected"
- Condition: "abortion"
- Condition: "miscarriage"
- Condition: "fever"
- Condition: "pus from the cervix"
- Measurement: "leukocytosis"
- Temporal: "> 14000"